相較之下，下列那一因素會有較大的心臟耗氧量？
A. 主動脈瓣狹窄
B. 主動脈瓣閉鎖不全
C. 左心室擴大
D. 左心室衰竭

正確答案：A. 主動脈瓣狹窄